Se ha determinado en un grupo de sujetos la presencia (x=1) o ausencia (x=0) de bacteriuria. ¿De qué tipo de variable se trata?
1. Ordinal.
2. Numérica.
3. Categórica.
4. Cuantitativa continua.
5. Cuantitativa discreta.

Respuesta correcta: 3. Categórica.